Clinical trial exclusion criterion:
Patients with hypertrophic occlusive myocardiopathy, severe occlusive coronary artery disease, aortic stenosis, hemodynamically significant aortic valve or mitral valve stenosis

Annotated entities:
- Condition: "hypertrophic occlusive myocardiopathy"
- Qualifier: "severe"
- Condition: "occlusive coronary artery disease"
- Condition: "aortic stenosis"
- Qualifier: "hemodynamically significant"
- Condition: "mitral valve stenosis"
- Condition: "aortic valve stenosis"